下列何種自體抗體為Sjögren's syndrome 特異性標示抗體？
A. 抗SSB/La抗體
B. 抗U1-RNP抗體
C. 抗Jo-1抗體
D. 抗Scl-70抗體

正確答案：A. 抗SSB/La抗體